Clinical trial exclusion criterion:
< 4 seizures/week on average in baseline period

Annotated entities:
- Condition: "seizures"
- Multiplier: "< 4 /week"